simple obesity

The above is a clinical trial inclusion criterion. Annotated with entity spans:
[Condition: simple obesity]